Unstable asthma or which may have required urgent care, hospitalization or intubation within the last 2 years, or which requires use of oral or intravenous corticosteroid.

The above is a clinical trial exclusion criterion. Annotated with entity spans:
[Condition: Unstable asthma] or which may have [Qualifier: required urgent care], [Procedure: hospitalization] or [Procedure: intubation] [Temporal: within the last 2 years], or which [Qualifier: requires use of oral] or [Drug: intravenous corticosteroid].